Clinical trial exclusion criterion:
History of major gastrointestinal tract surgery such as gastrectomy, gastroenterostomy, or bowel resection

Entity relations:
- Subsumes("major gastrointestinal tract surgery", "gastrectomy")
- AND("History", "major gastrointestinal tract surgery")
- OR("gastrectomy", "gastroenterostomy", "bowel resection")